14 歲的女生，2 年前右膝蓋腫痛，服用止痛藥無效，X 光顯示右腿遠端股骨有腫瘤浸潤，進行手術，病理切片證實是骨肉瘤。接受多次化療但反應不佳，做了腫瘤切除術並裝人工關節。復發後再做右小腿切除；肺部轉移的部分以手術切除。住院前一個月胸骨下方、肚臍之上常常陣發性像被電觸般的劇痛，臨床懷疑有脊髓轉移。下列處置計畫何者較適當？
A. 待核醫骨骼掃描證實後，照會神經外科醫師進行手術
B. 繼續給予進一步的化學治療
C. 建議照會麻醉科醫師做椎間注射止痛
D. 建議病人和家屬接受緩和醫療並做疼痛控制

正確答案：D. 建議病人和家屬接受緩和醫療並做疼痛控制